age=65 years

The above is a clinical trial inclusion criterion. Annotated with entity spans:
[Person: age][Value: =65 years]